男性原始生殖細胞約於何時開始進行細胞分化（cell differentiation）？
A. 胚胎發育之第五週
B. 胎兒發育之第三個月
C. 胎兒發育之第五個月
D. 青春期

正確答案：D. 青春期